Clinical trial inclusion criterion:
satisfying DSM-V criteria for ED and for half of the patients in addition

Annotated entities:
- Measurement: "DSM-V criteria"
- Value: "satisfying"
- Condition: "ED"
- Parsing_Error: "and for half of the patients in addition"